Clinical trial inclusion criterion:
Diagnosed with Major Depressive Disorder, unipolar or bipolar depression

Annotated entities:
- Condition: "Major Depressive Disorder"
- Condition: "unipolar depression"
- Condition: "bipolar depression"